Clinical trial exclusion criterion:
Patients with a history of prior pharmacogenomic testing;

Annotated entities:
- Competing_trial: "Patients with a history of prior pharmacogenomic testing"